Clinical trial inclusion criterion:
Adult (=18 years)

Entity relations:
- Has_value("years", "=18 years")
- Subsumes("Adult", "years")